Clinical trial exclusion criterion:
Abnormal Electro-cardiogram (ECG)

Annotated entities:
- Measurement: "Electro-cardiogram"
- Measurement: "ECG"
- Value: "Abnormal"